Subjects with over moderate atopic dermatitis (SCORAD score > 20)

The above is a clinical trial inclusion criterion. Annotated with entity spans:
Subjects with [Qualifier: over moderate] [Condition: atopic dermatitis] ([Measurement: SCORAD score] [Value: > 20])